Clinical trial exclusion criterion:
Presence of haemodynamically significant mitral and/or aortic valve disease, except mitral regurgitation secondary to LV dilatation.

Annotated entities:
- Qualifier: "haemodynamically significant"
- Condition: "aortic valve disease"
- Condition: "mitral valve disease"
- Condition: "mitral regurgitation"
- Qualifier: "secondary to LV dilatation"
- Condition: "LV dilatation"
- Negation: "except"